Clinical trial exclusion criteria:
Presence of organic pathology identified by upper endoscopy or other investigations
Presence of sliding hiatus hernia as defined by flap valve grade IV disruption of morphology at gastro-esophageal junction
Concurrent medications that affect gastrointestinal motility
Presence of acid reflux or heartburn symptoms of more than twice a month
History of gastric surgery
H. pylori infection
Use of PPI or NSAID in the past 4 weeks
Pregnancy
Known hypersensitivity to PPI

Annotated entities:
- Procedure: "upper endoscopy"
- Condition: "organic pathology"
- Procedure: "investigations"
- Condition: "hiatus hernia"
- Qualifier: "sliding"
- Measurement: "flap valve disruption of morphology"
- Value: "grade IV"
- Qualifier: "at gastro-esophageal junction"
- Drug: "medications"
- Condition: "gastrointestinal motility"
- Condition: "acid reflux"
- Condition: "heartburn symptoms"
- Temporal: "more than twice a month"
- Procedure: "gastric surgery"
- Condition: "H. pylori infection"
- Drug: "PPI"
- Drug: "NSAID"
- Temporal: "in the past 4 weeks"
- Condition: "Pregnancy"
- Condition: "hypersensitivity"
- Drug: "PPI"